Clinical trial inclusion criterion:
Type 2 diabetes mellitus with HbA1c > 7.5 %

Entity relations:
- Has_value("HbA1c", "> 7.5 %")